Clinical trial exclusion criterion:
Emergency surgery needed

Entity relations:
- Has_mood("Emergency surgery", "needed")